Las bases nitrogenadas alteradas o minoritarias:
1. No se detectan en el DNA.
2. No se detectan en el RNA.
3. Protegen la información genética.
4. No se detectan en el tRNA.
5. No son capaces de aparearse.

Respuesta correcta: 3. Protegen la información genética.